Clinical trial exclusion criterion:
Prior chemotherapy Prior treatment with gefitinib, erlotinib, or other drugs that target EGFR Patients must not be receiving any other investigational agents Any evidence of interstitial lung disease

Annotated entities:
- Procedure: "chemotherapy"
- Temporal: "Prior"
- Line: "Prior chemotherapy"
- Procedure: "treatment"
- Drug: "gefitinib"
- Temporal: "Prior"
- Drug: "erlotinib"
- Drug: "drugs that target EGFR"
- Line: "Prior treatment with gefitinib, erlotinib, or other drugs that target EGFR"
- Post-eligibility: "Patients must not be receiving any other investigational agents"
- Condition: "interstitial lung disease"